Clinical trial exclusion criterion:
Significant renal dysfunction (Serum creatinine > 2.0 mg/dl

Annotated entities:
- Qualifier: "Significant"
- Condition: "renal dysfunction"
- Measurement: "Serum creatinine"
- Value: "> 2.0 mg/dl"